Clinical trial inclusion criterion:
Healthy, women ages 18 to 39yo with BMI <30

Entity relations:
- Has_value("ages", "18 to 39yo")
- Has_value("BMI", "<30")